La transmisión del virus de la hepatitis E es vía:
1. Fecal-oral.
2. Secreciones corporales.
3. Sanguínea.
4. Placenta.
5. Aérea.

Respuesta correcta: 1. Fecal-oral.